Which is the database of molecular recognition features in membrane proteins?

mpMoRFsDB provides valuable information related to disorder-based protein-protein interactions in membrane proteins